History of organic brain disease

The above is a clinical trial exclusion criterion. Annotated with entity spans:
[Temporal: History of] [Condition: organic brain disease]